Clinical trial inclusion criterion:
Age 18 or older with unilateral or bilateral inguinal herna for laparoscopic repair

Annotated entities:
- Person: "Age"
- Value: "18 or older"
- Qualifier: "unilateral"
- Qualifier: "bilateral"
- Condition: "inguinal herna"
- Qualifier: "for laparoscopic repair"
- Procedure: "laparoscopic repair"